Abdominal obesity (>88cm women, >102cm men) AND hyperlipidemia (treated or fasting total cholesterol >240 English literacy Willing to provide informed consent

The above is a clinical trial inclusion criterion. Annotated with entity spans:
[Condition: Abdominal obesity] ([Value: >88cm] [Person: women], [Value: >102cm] [Person: men]) AND [Condition: hyperlipidemia] ([Procedure: treated] or [Measurement: fasting total cholesterol] [Value: >240] [Observation: English literacy] [Mood: Willing to] [Observation: provide informed consent]